Clinical trial inclusion criterion:
singleton pregnant women

Annotated entities:
- Qualifier: "singleton"
- Condition: "pregnant"
- Person: "women"